Clinical trial inclusion criterion:
ECOG=1 or if ECOG=2 but recover after pretreatment.

Annotated entities:
- Measurement: "ECOG"
- Value: "=1"
- Measurement: "ECOG"
- Value: "=2"
- Temporal: "after pretreatment"
- Reference_point: "pretreatment"
- Condition: "recover"
- Procedure: "pretreatment"